Clinical trial inclusion criterion:
KPS score with 50-100 points;

Entity relations:
- Has_value("KPS score", "50-100 points")